Clinical trial exclusion criterion:
PCI/MI within the past 2 months (60 days)

Entity relations:
- Subsumes("MI", "within the past 2 months")
- AND("MI", "PCI")
- OR("within the past 2 months", "within the past 60 days")